Clinical trial exclusion criterion:
Current Axis I primary psychiatric diagnosis other than major depressive disorder.

Entity relations:
- Has_qualifier("psychiatric diagnosis", "primary")
- Has_qualifier("psychiatric diagnosis", "Axis I")
- Has_negation("major depressive disorder", "other than")
- AND("psychiatric diagnosis", "major depressive disorder")